Clinical trial inclusion criterion:
HCV genotype 4,

Annotated entities:
- Measurement: "HCV genotype"
- Value: "4"